Known to be hypersensitivity to Bisoprolol, or any of the excipient.

The above is a clinical trial exclusion criterion. Annotated with entity spans:
Known to be [Condition: hypersensitivity] to [Drug: Bisoprolol], or [Qualifier: any] of the [Drug: excipient].